Malignancy diagnosed or treated within 5 years (recent localized treatment of squamous or non-invasive basal cell skin cancers is permitted; cervical carcinoma in situ is allowed if appropriately treated prior to screening); subjects under evaluation for a malignancy are not eligible.

The above is a clinical trial exclusion criterion. Annotated with entity spans:
[Condition: Malignancy] diagnosed or treated [Temporal: within 5 years] ([Temporal: recent] [Qualifier: localized] [Procedure: treatment] of [Condition: squamous] or [Condition: non-invasive basal cell skin cancer]s is [Negation: permitted]; [Condition: cervical carcinoma in situ] is [Negation: allowed] if [Qualifier: appropriately] [Procedure: treated] [Temporal: prior to screening]); [Non-representable: subjects under evaluation for a malignancy are not eligible.]